Clinical trial exclusion criterion:
Primary neurological disorder, including but not limited to dementia, stroke, brain tumors, epilepsy, Parkinson's disease, or demyelinating diseases

Entity relations:
- Subsumes("Primary neurological disorder", "dementia")
- OR("dementia", "Parkinson's disease", "epilepsy", "brain tumors", "stroke", "demyelinating diseases")